1. Male or female, 18-75 years old.

The above is a clinical trial inclusion criterion. Annotated with entity spans:
[Parsing_Error: 1.] [Person: Male] or [Person: female], [Value: 18-75 years] old.